use illicit drugs or relapse during the last trimester of pregnancy

The above is a clinical trial exclusion criterion. Annotated with entity spans:
use [Drug: illicit drugs] or [Condition: relapse] [Temporal: during the last trimester of pregnancy]